Clinical trial exclusion criterion:
received telbivudine as the antiviral therapy or have received more than one NA in the past.

Annotated entities:
- Drug: "telbivudine"
- Procedure: "antiviral therapy"
- Multiplier: "more than one"
- Condition: "NA"
- Temporal: "in the past"